Clinical trial exclusion criterion:
5. Pregnancy or breastfeeding

Entity relations:
- OR("Pregnancy", "breastfeeding")